Clinical trial inclusion criterion:
no PROM

Annotated entities:
- Condition: "PROM"
- Negation: "no"